1. Newly diagnosed, stage IV squamous cell lung cancer. This includes patients who present with disseminated metastases, and those with a malignant pleural or pericardial effusion (i.e., formerly stage IIIB in the 6th TNM staging system).

The above is a clinical trial inclusion criterion. Annotated with entity spans:
1. [Mood: Newly diagnosed], [Qualifier: stage IV] [Condition: squamous cell lung cancer]. This includes patients who present with [Qualifier: disseminated] [Condition: metastases], and those with a [Qualifier: malignant] [Condition: pleural] or [Condition: pericardial effusion] (i.e., formerly [Value: stage IIIB] in the [Measurement: 6th TNM staging system]).